滲透壓性（osmotic）腹瀉與分泌性（secretory）腹瀉的差異在於：
A. 前者糞便之 pH 值為微鹼性
B. 前者糞便中所含鈉離子濃度較高
C. 前者於禁食後，腹瀉停止，但後者則否
D. 前者糞便中之還原糖檢測呈陰性反應

正確答案：C. 前者於禁食後，腹瀉停止，但後者則否